接觸下列有機溶劑所導致之職業病，下列配對何者錯誤？
A. 二甲基甲醯胺（Dimethyl formaldehyde）→急性腎小管壞死
B. 二異氰酸甲苯（Toluene diisocyanate）→氣喘
C. 二硫化碳（Carbon disulfide）→動脈硬化
D. 苯（Benzene）→再生不良性貧血

正確答案：A. 二甲基甲醯胺（Dimethyl formaldehyde）→急性腎小管壞死